下列有關青少年行為問題的描述，何者正確？
A. 青少年的冒險行為與雄性激素無關
B. 性行為不屬於青少年的冒險行為
C. 生理、心理、社會及環境變化的不同步，與冒險行為有關
D. 物質濫用通常會合併使用興奮劑、大麻及古柯鹼

正確答案：C. 生理、心理、社會及環境變化的不同步，與冒險行為有關